Clinical trial inclusion criterion:
patient infected by multi drug resistant Gram negative bacteria susceptibly only to colistin

Annotated entities:
- Qualifier: "multi drug resistant"
- Condition: "Gram negative bacteria"
- Observation: "susceptibly"
- Multiplier: "only"
- Drug: "colistin"